Where is the protein slitrk1 localized?

Slitrk1 is enriched in postsynaptic fractions and is localized to excitatory synapses.